What is a SERM?

elective estrogen receptor modulator (SERM),.